舌骨下肌群（infrahyoid muscles）由 4 條肌肉組成，除了甲狀舌骨肌（thyrohyoid muscle）外，其餘 條肌肉是由下列何者支配？
A. 副神經（accessory nerve）
B. 舌下神經（hypoglossal nerve）
C. 第一至三頸神經之腹側枝（ventral rami）
D. 第四至六頸神經之腹側枝

正確答案：C. 第一至三頸神經之腹側枝（ventral rami）